Las cubiertas de tejido conjuntivo que rodean, protegen y mantienen el encéfalo y la médula espinal dentro de la cavidad craneal y del conducto vertebral se llaman meninges. ¿Cuál de las siguientes afirmaciones es correcta?
1. Las meninges no están formadas por tejido conectivo.
2. La piamadre se adhiere al encéfalo y a la médula espinal.
3. La aracnoides es la más gruesa y externa.
4. La duramadre se adhiere a la superficie interna de la aracnoides.
5. Las meninges sólo recubren el encéfalo.

Respuesta correcta: 2. La piamadre se adhiere al encéfalo y a la médula espinal.